For what known mutations is KRAS gene considered to be oncogenic?

G12C, G12V, G12D and G12A are all observed mutations of the KRAS oncogene.